有關兒童過敏性紫斑症引起的腎臟發炎（Henoch-Schӧnlein purpura nephritis），下列敘述何者正確？
A. 於發病時，都會同時合併上呼吸道感染（Upper respiratory tract infection）的症狀
B. 血尿（Hematuria）或蛋白尿（proteinuria）等腎臟方面的表現，都會與皮膚的表現（palpable purpura）同時
C. 與IgA腎炎（IgA nephropathy）的鑑別診斷，必需藉由病理切片作判斷
D. 急性期有併發腎炎的患者，成年後罹患慢性腎臟病（Chronic kidney disease）的機會較大

正確答案：D. 急性期有併發腎炎的患者，成年後罹患慢性腎臟病（Chronic kidney disease）的機會較大